Clinical trial inclusion criterion:
Body weight = 140 kg

Annotated entities:
- Measurement: "Body weight"
- Value: "= 140 kg"